Clinical trial exclusion criterion:
No hyperfluorescence on ICGA;

Annotated entities:
- Measurement: "ICGA"
- Value: "hyperfluorescence"
- Negation: "No"